Clinical trial exclusion criterion:
Acute pain (less than 3 months in duration)

Entity relations:
- Has_value("duration", "less than 3 months")
- Subsumes("Acute", "duration")
- Has_qualifier("pain", "Acute")